成熟的淋巴球在發育過程中會利用各種機制來達成自我耐受性（self-tolerance），下列何者和達成自我耐受性有直接的相關性？①AIRE基因 ②CTLA-4基因 ③Fas基因 ④正向選擇（positive selection） ⑤負向選擇（negative selection） ⑥regulatory T細胞形成
A. ①②③④⑥
B. ①②③⑤⑥
C. 僅②③⑤⑥
D. 僅①②③⑤

正確答案：B. ①②③⑤⑥